Clinical trial exclusion criterion:
Treated with anakinra, abatacept, or tocilizumab in the last 6 months

Entity relations:
- Has_temporal("anakinra", "in the last 6 months")
- OR("anakinra", "tocilizumab", "abatacept")